有些嚴重型的憂鬱症患者，會出現一種認為世界上一切事物都已不存在或不真實的妄想（nihilistic delusion），此現象稱為：
A. Cotard's syndrome
B. déjà vu
C. Anton's syndrome
D. factitious disorder

正確答案：A. Cotard's syndrome